Clinical trial inclusion criterion:
Clinical symptoms suggestive of pharyngitis with MC Isaac score =3

Annotated entities:
- Condition: "pharyngitis"
- Mood: "Clinical symptoms suggestive of"
- Measurement: "MC Isaac score"
- Value: "=3"